Clinical trial inclusion criterion:
BCVA of 24 letters or over

Annotated entities:
- Condition: "BCVA"
- Qualifier: "24 letters or over"